下列關於酵素反應的敘述，何者錯誤？
A. 酵素可以改變化學反應的平衡常數，使正反應的速率上升
B. 大多數的酵素為蛋白質，但少數核糖核酸分子（RNA）亦具有催化能力
C. 一般化學反應的速率會隨著溫度升高而上升，但大多數酵素反應的速率在溫度過高時會顯著降低
D. 酵素可區分光學性質不同的受質，因此反應的立體專一性（stereospecificity）極高

正確答案：A. 酵素可以改變化學反應的平衡常數，使正反應的速率上升